Después de un fuerte golpe en la rodilla y sobre todo si la extremidad inferior afectada está apoyando sobre el suelo, puede llegar a producirse la llamada "triada desgraciada" que afecta a tres elementos de los componentes anatómicos de la articulación de la rodilla. ¿Cuáles son éstos?
1. Ligamento colateral peroneo, ligamento cruzado posterior y menisco lateral.
2. Ligamento colateral tibial, ligamento cruzado anterior y menisco medial.
3. Ligamento colateral tibial, ligamento cruzado posterior y cruzado anterior.
4. Ligamento cruzado anterior, ligamento cruzado posterior y menisco medial.
5. Ligamento colateral peroneo, ligamento colateral tibial y cruzado anterior.

Respuesta correcta: 2. Ligamento colateral tibial, ligamento cruzado anterior y menisco medial.